Healthy, term, breastfeeding infants who will be predominately breastfed for at least 6-months. This will be determined by answering yes/no to question 'do you intend to breastfeed until your infant is at least 6 months of age.'

The above is a clinical trial inclusion criterion. Annotated with entity spans:
[Condition: Healthy], [Condition: term], [Observation: breastfeeding] [Person: infants] who will be [Observation: predominately breastfed] [Multiplier: for at least 6-months]. [Non-representable: This will be determined by answering yes/no to question 'do you intend to breastfeed until your infant is at least 6 months of age.']